化膿性鏈球菌（Streptococcus pyogenes）感染之後，有時會引起關節炎、心肌炎、心臟瓣膜破壞，其原因為何？
A. 由於化膿性鏈球菌抗原與上述的組織抗原有分子類似性（molecular mimicry），而導致自體免疫反應
B. 治療化膿性鏈球菌感染所用的抗生素引起的藥物危害
C. 化膿性鏈球菌感染後，引起 FoxP3 基因活化，調節型 T 細胞（Treg 細胞）增加所致
D. 化膿性鏈球菌過度增長，直接破壞組織所致

正確答案：A. 由於化膿性鏈球菌抗原與上述的組織抗原有分子類似性（molecular mimicry），而導致自體免疫反應